Clinical trial exclusion criteria:
Systemic therapy or radiotherapy within 4 weeks prior to Day 1
Prior therapy with agents targeting the DR5 apoptosis pathway
Major surgical procedure, open biopsy, or significant traumatic injury within 4 weeks prior to Day 1, or anticipation of need for major surgical procedure during the course of the study
Other invasive malignancies within 5 years prior to Day 1
Known active brain metastases
Uncontrolled intercurrent illness, including but not limited to ongoing or active infection requiring parenteral antibiotics at enrollment
Clinically significant, symptomatic cardiovascular disease, New York Heart Association (NYHA) Grade II or greater congestive heart failure, serious cardiac arrhythmia, Grade II or greater peripheral vascular disease, or history of major heart surgery within 6 months of Day 1, or any situation that would likely limit compliance with study requirements
Known to be positive for hepatitis C or hepatitis B surface antigen
History of other disease, metabolic dysfunction, physical examination finding, or clinical laboratory finding giving reasonable suspicion of a disease or condition that contraindicates use of an investigational drug or that might affect interpretation of the results of the study or render the patient at high risk for treatment complications
Use of anticoagulation therapy
Participation in clinical trials or undergoing other investigational procedures within 30 days prior to Day 1
Pregnancy or breast feeding
Known sensitivity to any of the products administered during the study
Any disorder that compromises the ability of the patient to give written informed consent and/or comply with study procedures

Annotated entities:
- Procedure: "Systemic therapy"
- Procedure: "radiotherapy"
- Temporal: "within 4 weeks prior to Day 1"
- Reference_point: "Day 1"
- Temporal: "Prior"
- Procedure: "therapy"
- Drug: "agents targeting the DR5 apoptosis pathway"
- Qualifier: "Major"
- Procedure: "surgical procedure"
- Procedure: "open biopsy"
- Qualifier: "significant"
- Condition: "traumatic injury"
- Temporal: "within 4 weeks prior to Day 1"
- Reference_point: "Day 1"
- Mood: "anticipation of need"
- Qualifier: "major"
- Procedure: "surgical procedure"
- Temporal: "during the course of the study"
- Reference_point: "the study"
- Qualifier: "Other"
- Condition: "invasive malignancies"
- Temporal: "within 5 years prior to Day 1"
- Reference_point: "Day 1"
- Qualifier: "active"
- Condition: "brain metastases"
- Temporal: "active"
- Qualifier: "Uncontrolled"
- Condition: "intercurrent illness"
- Temporal: "ongoing"
- Qualifier: "active"
- Condition: "infection"
- Drug: "parenteral antibiotics"
- Temporal: "at enrollment"
- Reference_point: "enrollment"
- Qualifier: "Clinically significant"
- Qualifier: "symptomatic"
- Condition: "cardiovascular disease"
- Measurement: "New York Heart Association (NYHA)"
- Value: "Grade II or greater"
- Condition: "congestive heart failure"
- Qualifier: "serious"
- Condition: "cardiac arrhythmia"
- Value: "Grade II or greater"
- Condition: "peripheral vascular disease"
- Temporal: "history of"
- Qualifier: "major"
- Procedure: "heart surgery"
- Temporal: "within 6 months of Day 1"
- Reference_point: "Day 1"
- Observation: "limit compliance"
- Value: "positive"
- Measurement: "hepatitis C"
- Measurement: "hepatitis B surface antigen"
- Temporal: "History"
- Qualifier: "other"
- Condition: "disease"
- Condition: "metabolic dysfunction"
- Procedure: "physical examination"
- Condition: "physical examination finding"
- Condition: "clinical laboratory finding"
- Procedure: "clinical laboratory"
- Mood: "suspicion of"
- Condition: "disease"
- Condition: "condition"
- Condition: "contraindicates"
- Drug: "investigational drug"
- Observation: "affect interpretation of the results"
- Observation: "render the patient at high risk"
- Condition: "treatment complications"
- Procedure: "anticoagulation therapy"
- Drug: "anticoagulation"
- Observation: "Participation in clinical trials"
- Observation: "undergoing other investigational procedures"
- Temporal: "within 30 days prior to Day 1"
- Reference_point: "prior to Day 1"
- Condition: "Pregnancy"
- Observation: "breast feeding"
- Condition: "sensitivity"
- Drug: "any of the products administered during the study"
- Condition: "disorder"
- Negation: "compromises the ability of"
- Measurement: "give written informed consent"
- Procedure: "comply with study procedures"